Clinical trial inclusion criterion:
20 = Age < 80 years

Entity relations:
- Has_value("Age", "20 =")
- OR("20 =", "< 80 years")